70歲女性，有高血壓、心房震顫病史，早上起床時，突然發生短暫性右側肢體無力，約5分鐘後完全復原，至門診求診，經腦部電腦斷層檢查正常後，下列何者處置較不適宜？
A. 應長期使用抗血小板藥物治療
B. 應長期使用抗凝血劑治療
C. 應長期使用降血壓藥物治療
D. 安排頸部血管超音波檢查

正確答案：A. 應長期使用抗血小板藥物治療